Patients who are on Tacrolimus immunosuppressive therapy twice a day for at least two weeks.

The above is a clinical trial inclusion criterion. Annotated with entity spans:
Patients who are on [Drug: Tacrolimus] immunosuppressive therapy [Multiplier: twice a day] for [Temporal: at least two weeks].